下列有關中央極限定理（central limit theorem）內容的敘述何者錯誤？
A. 樣本平均數之抽樣分布的標準差又稱標準誤，其值等於樣本標準差除以樣本數
B. 樣本平均數之抽樣分布的平均值等於母群體的平均值
C. 如果母群體為常態分布，即便樣本數不大，樣本平均數之抽樣分布也會接近常態分布
D. 如果樣本數夠大，則樣本平均數之抽樣分布定會接近常態分布

正確答案：A. 樣本平均數之抽樣分布的標準差又稱標準誤，其值等於樣本標準差除以樣本數